List the four most important interferonopathies

Aicardi-Goutières syndrome
chilblain lupus
ubiquitin specific peptidase 18 (USP18)-deficiency
Singleton-Merten syndrome